Clinical trial exclusion criterion:
Preexisting neurological deficits or peripheral neuropathy in the distribution of the sciatic nerve

Annotated entities:
- Condition: "neurological deficits"
- Condition: "peripheral neuropathy"
- Qualifier: "sciatic nerve"